Clinical trial exclusion criterion:
Patients who have undergone major surgery (e.g., intra-thoracic, -abdominal, or -pelvic) </= 4 weeks prior to starting study treatment or who have not recovered from such therapy

Annotated entities:
- Procedure: "major surgery"
- Procedure: "intra-thoracic"
- Procedure: "intra -abdominal"
- Procedure: "intra -pelvic"
- Subjective_judgement: "major surgery"
- Value: "</= 4 weeks prior to starting study treatment"
- Reference_point: "starting study treatment"
- Undefined_semantics: "recovered from such therapy"
- Subjective_judgement: "recovered from such therapy"
- Negation: "not"
- Condition: "recovered from such therapy"